Clinical trial exclusion criterion:
uncontrolled hypertension (treated systolic blood pressure > 155 mmHg or diastolic blood pressure > 95 mmHg)

Entity relations:
- Has_qualifier("hypertension", "uncontrolled")
- Has_value("systolic blood pressure", "> 155 mmHg")
- Has_value("diastolic blood pressure", "> 95 mmHg")
- Has_qualifier("systolic blood pressure", "treated")
- Subsumes("hypertension", "systolic blood pressure")
- OR("systolic blood pressure", "diastolic blood pressure")